What is the basis of the methodology of "functional class scoring" (FCS) for the analysis of gene expression data?

The second method, "functional class scoring" (FCS), examines the statistical distribution of individual gene scores among all genes in the gene ontology class and does not involve an initial gene selection step.